Presence of liver cirrhosis

The above is a clinical trial inclusion criterion. Annotated with entity spans:
Presence of [Condition: liver cirrhosis]